Emergent condition like hematemesis.

The above is a clinical trial exclusion criterion. Annotated with entity spans:
[Condition: Emergent condition] like [Condition: hematemesis].